患者對於女性絲襪或內衣褲可達到性興奮之目的，但卻為此深感困擾，是屬於下列何種性癖症？
A. 暴露症（exhibitionism）
B. 戀童症（pedophilia）
C. 戀物症（fetishism）
D. 性虐待症（sadism）

正確答案：C. 戀物症（fetishism）